Clinical trial inclusion criterion:
unresectable synchronous metastases

Annotated entities:
- Qualifier: "unresectable"
- Qualifier: "synchronous"
- Condition: "metastases"